Which technique is used for detection of EWS/FLI1 fusion transcripts?

Molecular detection of EWS-FLI1 chimeric transcripts in Ewing family tumors is carried out by reverse transcription-polymerase chain reaction (RT-PCR).